下列那一種免疫抑制劑之作用機轉在於抑制 inosine monophosphate dehydrogenase 而進一步減低 T 及 B 淋巴細胞增生？
A. Azathioprine
B. Cyclosporine
C. Mycophenolate mofetil
D. Tacrolimus

正確答案：C. Mycophenolate mofetil